建立基因剔除鼠（knockout mouse）的過程中，一般以取出實	動物之何種細胞進行基因剔除？
A. 卵細胞
B. 精細胞
C. 受精卵
D. 胚胎幹細胞

正確答案：D. 胚胎幹細胞